下列有關恙蟲病（Scrub typhus）的敘述，何者錯誤？
A. 致病菌為 Rickettsia rickettsii
B. 潛伏期約 6-21 天，臺灣以東部以及離島地區較常見
C. 臨床症狀的表現為發燒、頭痛、肌肉酸痛，部分病人皮膚會有 eschar lesion
D. 可用 tetracycline 類的藥物治療

正確答案：A. 致病菌為 Rickettsia rickettsii